Clinical trial inclusion criterion:
Presence of at least 2 cryopreserved good quality cleavage-stage embryo (good quality cleavage-stage embryos display stage-specific cell division, have blastomeres of fairly equal size with few to no cytoplasmic fragments).

Annotated entities:
- Multiplier: "at least 2"
- Observation: "cleavage-stage embryo"
- Qualifier: "good"
- Qualifier: "cryopreserved"